The patient, in the opinion of the Investigator, is unable to adhere to the requirements of the study.

The above is a clinical trial exclusion criterion. Annotated with entity spans:
[Non-query-able: The patient, in the opinion of the Investigator, is unable to adhere to the requirements of the study].